Elevated liver enzyme (aspartate transaminase (AST)/ alanine transaminase(ALT) level are more than twice normal range) , history of liver cirrhosis, impaired liver function(elevated total bilirubin level) and coagulopathy (including long-term use anticoagulant)

The above is a clinical trial exclusion criterion. Annotated with entity spans:
[Value: Elevated] [Measurement: liver enzyme] ([Measurement: aspartate transaminase (AST)/ alanine transaminase(ALT) level] are [Value: more than twice normal range]) , [Temporal: history] of [Condition: liver cirrhosis], [Condition: impaired liver function]([Value: elevated] [Measurement: total bilirubin level]) and [Condition: coagulopathy] (including [Multiplier: long-term use] [Drug: anticoagulant])